Which is the role of the IFIT1 gene in Systemic Lupus Erythematosus (SLE)?

IFIT1 is the first gene described as a candidate gene for SLE, and may function by activating Rho proteins through interaction with Rho/Rac guanine nucleotide exchange factor . IfIT1 and the interferon-related pathway may provide potential targets for novel interventions in the treatment of SLE . Ifit1 may regulate the activation of Rho and Rac proteins, thus being involved in the pathogenesis of the disease .